Señalar cuáles de los siguientes síntomas de la esquizofrenia constituye un factor de mal pronóstico:
1. Pródromo breve
2. Ausencia de síntomas depresivos.
3. Inicio de 25 a 30 años
4. Ausencia de síntomas obsesivos.

Respuesta correcta: 2. Ausencia de síntomas depresivos.